Clinical trial inclusion criteria:
A positive 13 C-urea breath test
Formal H.pylori treatment more than two times
Age >18 years

Annotated entities:
- Measurement: "13 C-urea breath test"
- Value: "positive"
- Procedure: "H.pylori treatment"
- Multiplier: "more than two times"
- Person: "Age"
- Value: ">18 years"